Clinical trial exclusion criterion:
Women did not have breast cancer

Annotated entities:
- Negation: "not"
- Condition: "breast cancer"